Patients scheduled for laser laryngeal surgery under general anesthesia with either Propofol or desflurane based technique.

The above is a clinical trial inclusion criterion. Annotated with entity spans:
Patients [Mood: scheduled] for [Procedure: laser laryngeal surgery] under [Procedure: general anesthesia] with either [Drug: Propofol] or [Drug: desflurane] based technique.